Clinical trial exclusion criterion:
Pathologically altered level of any serum electrolyte (sodium, potassium, magnesium, calcium, chloride, phosphate) unless corrected prior to the start of study treatment

Entity relations:
- Subsumes("level of any serum electrolyte", "sodium")
- Has_value("level of any serum electrolyte", "Pathologically altered")
- OR("sodium", "potassium", "magnesium", "calcium", "chloride", "phosphate")